Subjects with healthy eyes

The above is a clinical trial inclusion criterion. Annotated with entity spans:
Subjects with [Condition: healthy eyes]